一位36歲男性工人，不幸被一塊掉下來的石頭打到胸骨下方， 一小時後被送到醫院來，病人主述胸部疼痛，X光檢查發現左側第八根肋骨骨折， 經止痛後病人仍感到胸部不舒服， 病人最不可能有什麼傷害？
A. 肺葉破裂
B. 氣管破裂
C. 大血管破裂
D. 橫膈膜破裂

正確答案：C. 大血管破裂